子宮內膜腺癌病患求診，身高160公分，體重82公斤，經詳細追蹤其病史，發現初經年齡為10歲，停經年齡為55歲，結婚初期曾因不想生育，服用過口服避孕藥有3～5年，後抹片異常經診斷為cervical intraepithelial neoplasia 2（CIN 2），曾接受局部治療。病患之子宮內膜癌的高危險因子中，不包括下列何者？
A. 肥胖
B. 初經早
C. 停經晚
D. 服用口服避孕藥

正確答案：D. 服用口服避孕藥